垂直線性加速度主要由何者來感應？
A. 水平半規管
B. 上半規管
C. 橢圓囊（utricle）
D. 球囊（saccule）

正確答案：D. 球囊（saccule）